Documented restrictions on military duties

The above is a clinical trial exclusion criterion. Annotated with entity spans:
Documented [Observation: restrictions on military duties]